Clinical trial exclusion criterion:
Hypnotic medication prescribed or approved by the study physician, (up to a three doses per week) for insomnia, as long if not the night before a PET/MRI or clinic ratings visit. Antipsychotic medications, whether prescribed for sleep or other indications, are prohibited.

Entity relations:
- AND("Hypnotic medication", "insomnia")
- Has_index("the night before a PET/MRI or clinic ratings visit.", "PET/MRI")
- Has_temporal("Hypnotic medication", "the night before a PET/MRI or clinic ratings visit.")
- Has_negation("Hypnotic medication", "not")
- Has_index("the night before a PET/MRI or clinic ratings visit.", "PET/MRI")
- Has_index("the night before a PET/MRI or clinic ratings visit.", "clinic ratings visit.")
- OR("PET/MRI", "clinic ratings visit.")